Clinical trial inclusion criterion:
5. Patients on standard treatment of chronic heart failure at the target dose or maximum tolerance dose for over 1 month ,or unchanged dose in last 1 month;

Annotated entities:
- Condition: "chronic heart failure"
- Procedure: "treatment of chronic heart failure"
- Observation: "maximum tolerance dose"
- Observation: "target dose"
- Temporal: "for over 1 month"
- Temporal: "in last 1 month"
- Observation: "unchanged dose"